Clinical trial exclusion criterion:
Known hypersensitivity to LDV/SOF

Annotated entities:
- Condition: "hypersensitivity"
- Drug: "LDV"
- Drug: "SOF"